Clinical trial exclusion criterion:
Less than two months treatment of adjunctive medications AND less than one month on same dose: beta blockers, antidepressants, mood stabilizers, antianxiety medications.

Entity relations:
- AND("treatment", "adjunctive medications")
- Has_multiplier("treatment", "Less than two months")
- Has_multiplier("same dose", "less than one month")
- Has_multiplier("treatment", "same dose")
- Subsumes("adjunctive medications", "beta blockers")
- OR("beta blockers", "antidepressants", "mood stabilizers", "antianxiety medications")